Which gene is most commonly associated with severe congenital and cyclic neutropenia?

Neutrophil elastase gene (ELANE) mutations are responsible for the majority of cases of severe congenital neutropenia (SCN) and cyclic neutropenia (CN).